La variación de entropía (       ) del universo es positiva:
1. En todo proceso irreversible.
2. En todo proceso reversible.
3. Cuando el sistema está en equilibrio.
4. En los procesos cíclicos.

Respuesta correcta: 1. En todo proceso irreversible.